Clinical trial exclusion criterion:
History of colonic mucosal dysplasia or adenomatous colonic polyps that were not removed

Entity relations:
- Has_negation("removed", "not")
- AND("adenomatous colonic polyps", "removed")
- OR("colonic mucosal dysplasia", "adenomatous colonic polyps")